It is impossible to correctly inform the patient or his/her representative

The above is a clinical trial exclusion criterion. Annotated with entity spans:
[Post-eligibility: It is impossible to correctly inform the patient or his/her representative]